Clinical trial exclusion criterion:
History of congesting heart failure with left ventricular ejection fraction <30% or exacerbation in the past 30 days.

Annotated entities:
- Condition: "congesting heart failure"
- Measurement: "left ventricular ejection fraction"
- Value: "<30%"
- Condition: "exacerbation"
- Temporal: "in the past 30 days"